Previous treatment with brentuximab vedotin.

The above is a clinical trial exclusion criterion. Annotated with entity spans:
Previous treatment with [Drug: brentuximab] vedotin.